medical indication for induction of labor

The above is a clinical trial inclusion criterion. Annotated with entity spans:
[Condition: medical indication] for [Procedure: induction of labor]